Clinical trial exclusion criterion:
Thrombocytopenia < 50 x 10 gigalitres (Gl)

Annotated entities:
- Measurement: "Thrombocytopenia"
- Value: "< 50 x 10 gigalitres (Gl)"